Clinical trial inclusion criterion:
Parkinson disease diagnosed by United Kingdom Parkinson's disease Society Brain Bank Criteria

Annotated entities:
- Condition: "Parkinson disease"
- Measurement: "United Kingdom Parkinson's disease Society Brain Bank Criteria"